Los modelos humanístico existenciales y fenomenológicos se caracterizan por:
1. Su énfasis en el origen de los síntomas en la infancia del paciente.
2. Confluir sus enfoques terapéuticos en el esquema conceptual Padre-Adulto-Niño derivado de la bioenergética.
3. Su énfasis en el vivencia inmediata y el “aquí y ahora”.
4. La reticencia a creer que la perspectiva del cliente tenga alguna utilidad.
5. Una concepción atomizada del ser humano.

Respuesta correcta: 3. Su énfasis en el vivencia inmediata y el “aquí y ahora”.